林女士現年 56 歲，身高 159 cm，體重 60 kg，因最近常常會頭暈，所以在某醫院測空腹血糖為 290 mg/dL，糖化血紅素 9.9%，肌酸酐（creatinine）1.9 mg/dL，鉀離子 5.2 meq/L，尿液分析：尿蛋白++，尿糖++。下列那一項資料對了解林女士的病情最有幫助？
A. 腰圍
B. BUN
C. 血壓
D. 尿酸

正確答案：C. 血壓